Clinical trial exclusion criterion:
5. Known allergies to: aspirin, clopidogrel (Plavix) and ticlopidine (Ticlid), heparin, bivalirudin, stainless steel, or contrast agent (which cannot be adequately premedicated).

Annotated entities:
- Drug: "aspirin"
- Drug: "clopidogrel"
- Drug: "Plavix"
- Drug: "ticlopidine"
- Drug: "Ticlid"
- Drug: "heparin"
- Drug: "bivalirudin"
- Observation: "stainless steel"
- Drug: "contrast agent"
- Condition: "allergies"